Patients who receive a graft from a cadaver donor.

The above is a clinical trial exclusion criterion. Annotated with entity spans:
Patients who receive a [Procedure: graft from a cadaver donor].